Currently meet Diagnostic and Statistical Manual of Mental Disorders - Fifth Edition (DSM-5) criteria for substance use disorder, or history thereof, within 12 months before dosing.

The above is a clinical trial exclusion criterion. Annotated with entity spans:
Currently meet [Measurement: Diagnostic and Statistical Manual of Mental Disorders - Fifth Edition] ([Measurement: DSM-5]) criteria for [Condition: substance use disorder], or history thereof, [Temporal: within 12 months] before dosing.